下列何者不是青光眼有關之視神經盤變化？
A. 視神經盤局部凹痕（focal notching of optic disc）
B. 視神經盤凹杯變深（increase depth of optic cup）
C. 視神經盤血管向鼻側移位（nasal displacement of retinal vessels on the optic disc）
D. 視神經盤水腫（optic disc edema）

正確答案：D. 視神經盤水腫（optic disc edema）